¿El objetivo de las técnicas de focalización para el tratamiento de las alucinaciones auditivas es?
1. Que los pacientes se distraigan de las alucinaciones.
2. Que los pacientes reatribuyan gradualmente el origen de las alucinaciones auditivas a sí mismos.
3. Que los pacientes no atiendan a las voces.
4. Que los pacientes con alucinaciones tomen la medicación.
5. Que los pacientes no piensen en las alucinaciones.

Respuesta correcta: 2. Que los pacientes reatribuyan gradualmente el origen de las alucinaciones auditivas a sí mismos.